Active cancer

The above is a clinical trial exclusion criterion. Annotated with entity spans:
[Qualifier: Active] [Condition: cancer]